下列關於傳染性紅斑症（erythema infectiosum）的敘述，何者錯誤？
A. 臉部紅疹出現在類感冒症狀之後
B. 由 Parvovirus B19 引起
C. 此病毒在成人可能會引發關節炎
D. 病毒偏好感染白血球前期細胞

正確答案：D. 病毒偏好感染白血球前期細胞